Clinical trial exclusion criterion:
Current use of gabapentin or pregabalin

Entity relations:
- Has_temporal("gabapentin", "Current")
- OR("gabapentin", "pregabalin")